Previous enrolment in this study or treatment with an investigational drug or device under another study protocol in the past 7 days

The above is a clinical trial exclusion criterion. Annotated with entity spans:
[Competing_trial: Previous enrolment in this study or treatment with an investigational drug or device under another study protocol in the past 7 days]